Clinical trial inclusion criterion:
community-acquired pneumonia: the presence of radiologically confirmed infiltration of the lung tissue; the presence of at least two of the following clinical signs: acute fever early in the disease (temperature > 38.0°C), cough with sputum, the physical signs of pneumonia (focus of crepitate and/or fine bubble rales, bronchial breathing hard, shortening of percussion sounds), leukocytosis > 10*10 9 /l and/or stab shift > 10%; the occurrence of the disease outside the hospital and the organized groups (such as nursing homes, sanatoriums, etc.).

Annotated entities:
- Qualifier: "radiologically confirmed"
- Procedure: "radiologically"
- Condition: "infiltration of the lung tissue"
- Multiplier: "at least two"
- Condition: "acute fever"
- Temporal: "early in the disease"
- Measurement: "temperature"
- Value: "> 38.0°C"
- Condition: "cough with sputum"
- Condition: "pneumonia"
- Condition: "physical signs"
- Condition: "crepitate rales"
- Condition: "fine bubble rales"
- Condition: "bronchial breathing hard"
- Condition: "shortening of percussion sounds"
- Measurement: "leukocytosis"
- Value: "> 10*10 9 /l"
- Measurement: "stab shift"
- Value: "> 10%"
- Condition: "community-acquired pneumonia"